Clinical trial exclusion criterion:
4. Pregnancy within the past 6 months and/or breast-feeding

Entity relations:
- Has_temporal("Pregnancy", "within the past 6 months")
- Has_temporal("breast-feeding", "within the past 6 months")
- OR("Pregnancy", "breast-feeding")